Clinical trial exclusion criterion:
Concomitant use of NSAIDS, ASA, and other anticoagulants.

Entity relations:
- Has_qualifier("anticoagulants", "other")
- Has_temporal("NSAIDS", "Concomitant")
- OR("NSAIDS", "anticoagulants", "ASA")